Clinical trial inclusion criteria:
Control: devoid of any systemic or neurological diseases
Chronic migraine: by ICHD-III (International Classification of Headache Disorder) criteria
Fibromyalgia: by ACR (American College of Rheumatology) 2010 criteria

Annotated entities:
- Negation: "devoid"
- Condition: "neurological diseases"
- Condition: "systemic diseases"
- Condition: "Chronic migraine"
- Qualifier: "ICHD-III"
- Qualifier: "International Classification of Headache Disorder"
- Condition: "Fibromyalgia"
- Qualifier: "American College of Rheumatology"
- Qualifier: "ACR 2010 criteria"